Planned operation of laparoscopic Roux-en Y gastric bypass (LRYGB) or laparoscopic sleeve gastrectomy (LSG) as primary bariatric procedure

The above is a clinical trial inclusion criterion. Annotated with entity spans:
Planned operation of [Procedure: laparoscopic Roux-en Y gastric bypass (LRYGB)] or [Procedure: laparoscopic sleeve gastrectomy (LSG)] as [Qualifier: primary] bariatric procedure